Clinical trial inclusion criterion:
are high level ambulators corresponding to levels E to F of the Special Interest Group of Amputee Medicine (SIGAM) mobility grade

Annotated entities:
- Condition: "high level ambulators"
- Measurement: "Special Interest Group of Amputee Medicine (SIGAM) mobility grade"
- Value: "levels E to F"